Clinical trial exclusion criterion:
Subjects with known intolerance to blood products or to one of the components of the study product or is unwilling to receive blood products;

Annotated entities:
- Condition: "intolerance"
- Procedure: "blood products"
- Non-query-able: "to one of the components of the study product or is unwilling to receive blood products"